Clinical trial inclusion criterion:
Presented for elective gastrointestinal endoscopy

Entity relations:
- Has_qualifier("gastrointestinal endoscopy", "elective")